Clinical trial exclusion criterion:
Inability or unwilling to give informed consent

Annotated entities:
- Informed_consent: "Inability or unwilling to give informed consent"